Be healthy on the basis of clinical laboratory tests performed at Screening. If the results of the serum chemistry panel [including liver enzymes], hematology, or urinalysis are outside the normal reference ranges, the participant may be included only if the investigator judges the abnormalities or deviations from normal to be not clinically significant. This determination must be recorded in the participants' source documents and initialed by the investigator

The above is a clinical trial inclusion criterion. Annotated with entity spans:
Be [Condition: healthy] on the basis of [Procedure: clinical laboratory tests] [Temporal: performed at Screening]. If the results of the [Measurement: serum chemistry panel] [including [Measurement: liver enzymes]], [Measurement: hematology], or [Procedure: urinalysis] are [Value: outside the normal reference range]s, the participant may be included only if [Subjective_judgement: the investigator judges] the abnormalities or deviations from normal to be [Subjective_judgement: not clinically significant]. [Not_a_criteria: This determination must be recorded in the participants' source documents and initialed by the investigator]